都會區光化學煙霧主要為空氣中碳氫化合物與下列何類物質反應產生？
A. 硫氧化物
B. 氮氧化物
C. 一氧化碳
D. 氟氯碳化物

正確答案：B. 氮氧化物